Which type of GTPases is required for amino acid-dependent activation of mTORC1?

Heterodimeric Rag GTPases are required for amino-acid-mediated mTORC1 activation at the lysosome